18 years of age or older

The above is a clinical trial inclusion criterion. Annotated with entity spans:
18 years of [Person: age] or [Value: older]